Durante la fosforilación oxidativa, la fuerza protón-motriz que se genera por el trasporte electrónico se usa para:
1. Crear un poro en la membrana mitocondrial interna.
2. Generar los sustratos (ADP y Pi) para la ATP sintasa.
3. Inducir un cambio conformacional en la ATP sintasa.
4. Oxidar NADH a NAD+.
5. Reducir O2 a H2O.

Respuesta correcta: 3. Inducir un cambio conformacional en la ATP sintasa.